history of ARF,scarlet fever,impetigo,acute glomerulonephritis

The above is a clinical trial exclusion criterion. Annotated with entity spans:
[Temporal: history] of [Condition: ARF],[Condition: scarlet fever],[Condition: impetigo],[Condition: acute glomerulonephritis]